Clinical trial exclusion criterion:
type 1 diabetes,specific types of diabetes,gestational diabetes or pregestational diabetes;

Annotated entities:
- Condition: "type 1 diabetes"
- Condition: "diabetes"
- Qualifier: "specific types"
- Condition: "gestational diabetes"
- Condition: "pregestational diabetes"